一位 58 歲男性病人，因車禍導致腹膜炎接受剖腹探查手術，發現有多處小腸破裂併腸系膜血腫，最後接受 25 公分長度的小腸切除及小腸吻合手術，10 日後發現引流管有腸道內容物成分，每日流出量 ml，腹部平坦鬆軟無腹痛症狀，體溫 37.4℃，則你的診斷為何？
A. 短腸症候群（short bowel syndrome）
B. 缺血性腸道疾病（ischemic bowel disease）
C. 沾黏性腸阻塞（adhesion ileus）
D. 癒合不全而可能形成腸道皮膚管（enterocutaneous fistula）

正確答案：D. 癒合不全而可能形成腸道皮膚管（enterocutaneous fistula）